Clinical trial exclusion criterion:
Daily narcotic or opiate use for greater than the 2 months prior to enrollment in the study.

Entity relations:
- Has_index("for greater than the 2 months prior to enrollment in the study", "enrollment in the study")
- Has_multiplier("narcotic", "Daily")
- Has_temporal("narcotic", "for greater than the 2 months prior to enrollment in the study")
- OR("narcotic", "opiate")